Serum alanine transaminase > 3 times upper limit of normal

The above is a clinical trial exclusion criterion. Annotated with entity spans:
[Measurement: Serum alanine transaminase] [Value: > 3 times upper limit of normal]